El componente de las bacterias Gram negativas directamente responsable de la actividad endotóxica es:
1. El lípido A.
2. Las porinas.
3. Las proteínas de unión a penicilina.
4. El antígeno O.
5. Las lipoproteínas.

Respuesta correcta: 1. El lípido A.